6. Bilirubin <2x, AST <3x, Serum creatinine <2x upper limit of normal, Hgb >8.0

The above is a clinical trial inclusion criterion. Annotated with entity spans:
[Parsing_Error: 6.] [Measurement: Bilirubin] [Value: <2x], [Measurement: AST] [Value: <3x], [Measurement: Serum creatinine] [Value: <2x upper limit of normal], [Measurement: Hgb] [Value: >8.0]